下列何者是乳癌病理組織報告中，做為判斷輔助性化學治療（chemotherapy）的必要因子？①腫瘤大小 ② 淋巴轉移 ③位置 ④荷爾蒙接受器陽陰性
A. ①②③
B. ①③④
C. ①②④
D. ②③④

正確答案：C. ①②④